Clinical trial exclusion criterion:
incooperative for glucose monitor

Annotated entities:
- Procedure: "glucose monitor"
- Condition: "incooperative"